BRCA1 與 BRCA2 基因的突變與下列那些癌症遺傳症候群（inherited cancer syndrome）最有關？
A. 腎細胞癌
B. 肺癌
C. 大腸癌
D. 卵巢癌

正確答案：D. 卵巢癌